Clinical trial inclusion criterion:
Diagnosis of MDD (Major Depressive Disorder), made or affirmed by a senior psychiatrist in Shalvata

Entity relations:
- Subsumes("MDD", "Major Depressive Disorder")